Clinical trial exclusion criterion:
Planned surgery under regional anesthesia

Entity relations:
- AND("surgery", "regional anesthesia")
- Has_mood("surgery", "Planned")